Patient has been permanently discontinued from nilotinib treatment in the parent study due to unacceptable toxicity, non-compliance to study procedures, withdrawal of consent or any other reason

The above is a clinical trial exclusion criterion. Annotated with entity spans:
Patient has been [Multiplier: permanently] [Negation: discontinued] from [Drug: nilotinib] [Procedure: treatment] in the parent study due to [Condition: unacceptable toxicity], [Observation: non-compliance] to [Procedure: study procedures], [Negation: withdrawal] of [Observation: consent] or [Observation: any other reason]